Have ≥2 days/week of heavy drinking (>4 drinks/day)

The above is a clinical trial inclusion criterion. Annotated with entity spans:
Have [Multiplier: ≥2 days/week] of [Condition: heavy drinking] ([Value: >4] [Measurement: drinks/day])